Written informed consent.

The above is a clinical trial inclusion criterion. Annotated with entity spans:
[Post-eligibility: Written informed consent].